Which is the protein encoded by the human gene GRIK?

Glutamate Receptor Ionotropic Kainate